experiences motion sickness in response to driving simulator

The above is a clinical trial exclusion criterion. Annotated with entity spans:
experiences [Condition: motion sickness] in response to driving simulator